La definición de Atención Primaria de Salud (APS) como “asistencia esencial, basada en métodos y tecnologías prácticos, científicamente fundados y socialmente aceptables, puesta al alcance de todos los individuos y familias de la comunidad, mediante su plena participación, y a un coste que la comunidad y el país puedan soportar, en todas y cada una de las etapas de su desarrollo con un espíritu de autorresponsabilidad y autodeterminación”, se estableció en:
1. La Conferencia de la OMS-Unicef de AlmaAta (1978).
2. Estrategia Mundial de la Salud para todos en el año 2000 (1981).
3. La Carta de Ottawa (1986).
4. 51ª Asamblea Mundial de la Salud (1998).
5. Ley general de Sanidad 14/1986 de 25 de abril.

Respuesta correcta: 1. La Conferencia de la OMS-Unicef de AlmaAta (1978).